Clinical trial inclusion criterion:
hemoglobin ≥ 9 g/dl or 5.59 mmol/l

Annotated entities:
- Measurement: "hemoglobin"
- Value: "≥ 9 g/dl"
- Value: "≥ 5.59 mmol/l"